Clinical trial inclusion criterion:
Creatinine =< 1.5 x upper limit of normal

Annotated entities:
- Measurement: "Creatinine"
- Value: "=< 1.5 x upper limit of normal"